allergic to GLP-1 receptor agonist

The above is a clinical trial exclusion criterion. Annotated with entity spans:
[Condition: allergic] to [Drug: GLP-1 receptor agonist]